具有靜纖毛（stereocilia）的毛細胞可在耳朵多處發現，但下列何者不具有此構造？
A. 橢圓囊斑（macula of utricle）
B. 耳蝸的 Corti 氏器
C. 前庭器壺腹（ampulla of vestibular apparatus）
D. 聽管（auditory or Eustachian tube）

正確答案：D. 聽管（auditory or Eustachian tube）